下列有關抗血液凝固成分 heparin 之描述何者正確？
A. 本身具有血栓分解能力（thrombolytic activity）
B. 必須與 antithrombin 結合才有生物活性作用
C. 口服半衰期作用持久
D. 必須阻斷 vitamin K 之再生成才有活性作用

正確答案：B. 必須與 antithrombin 結合才有生物活性作用